¿Qué prueba permite diferenciar Staphylococcus aureus del resto de especies de Staphylococcus?:
1. Oxidasa.
2. Catalasa.
3. Coagulasa.
4. Ureasa.

Respuesta correcta: 3. Coagulasa.